Clinical trial exclusion criterion:
Untreated hyperthyroidism, or hypothyroidism.

Entity relations:
- Has_qualifier("hyperthyroidism", "Untreated")
- OR("hyperthyroidism", "hypothyroidism")